Diagnosed epileptic patients of either sex with age between 10-19 yrs (<19yrs), coming to the medicine Out Patient /In Patient Departments and undergoing AED therapy for more than 6 months.

The above is a clinical trial inclusion criterion. Annotated with entity spans:
Diagnosed [Condition: epileptic] patients of either sex with [Person: age] [Value: between 10-19 yrs] ([Value: <19yrs]), coming to the medicine [Visit: Out Patient] /[Visit: In Patient Departments] and undergoing [Procedure: AED therapy] [Temporal: for more than 6 months].